Presence of tachycardia with irregular or supraventricular RR

The above is a clinical trial exclusion criterion. Annotated with entity spans:
Presence of [Condition: tachycardia] with [Condition: irregular] or [Condition: supraventricular RR]